Newly diagnosed and untreated sputum smear positive tuberculosis patient

The above is a clinical trial inclusion criterion. Annotated with entity spans:
[Qualifier: Newly diagnosed] and [Qualifier: untreated] [Measurement: sputum smear] [Value: positive] [Condition: tuberculosis] patient